The patients have bilateral breast cancers or DCIS or metastatic breast cancers.

The above is a clinical trial exclusion criterion. Annotated with entity spans:
The patients have [Condition: bilateral breast cancers] or [Condition: DCIS] or [Condition: metastatic breast cancers].